Clinical trial exclusion criterion:
Inability to complete an MRI (contraindications for MRI include but are not restricted to weight =140 kg, pacemaker, cochlear implants, presence of foreign substances in the eye, intracranial vascular clips, surgery within 6 weeks of entry into the study, coronary stent implanted within 8 weeks prior to the time of the intended MRI, etc…)

Annotated entities:
- Procedure: "MRI"
- Mood: "Inability to complete"
- Condition: "contraindications"
- Procedure: "MRI"
- Measurement: "weight"
- Value: "=140 kg"
- Device: "pacemaker"
- Device: "cochlear implants"
- Device: "foreign substances in the eye"
- Device: "intracranial vascular clips"
- Procedure: "surgery"
- Temporal: "within 6 weeks of entry into the study"
- Reference_point: "entry into the study"
- Device: "coronary stent"
- Procedure: "implanted"
- Temporal: "within 8 weeks prior to the time of the intended MRI"
- Reference_point: "the time of the intended MRI"
- Procedure: "MRI"
- Mood: "intended"